Clinical trial inclusion criterion:
AFC> 10

Entity relations:
- Has_value("AFC", "> 10")